Subjects who lost >200 mL during a single apheresis or who lost red blood cells on more than one occasion during apheresis within the previous 60 days.

The above is a clinical trial exclusion criterion. Annotated with entity spans:
Subjects who lost [Value: >200 mL] during a [Multiplier: single] [Procedure: apheresis] or who [Measurement: lost red blood cells] on [Multiplier: more than one occasion] during [Procedure: apheresis] [Temporal: within the previous 60 days].